Diaphragmatic palsy

The above is a clinical trial exclusion criterion. Annotated with entity spans:
[Condition: Diaphragmatic palsy]